Clinical trial exclusion criterion:
Slowed heart rate, causing symptoms (symptomatic bradycardia),

Entity relations:
- Has_qualifier("heart rate", "Slowed")
- AND("heart rate", "symptoms")
- Subsumes("heart rate", "bradycardia")
- Has_qualifier("bradycardia", "symptomatic")